severe valvular or left ventricular outflow obstruction disease needing intervention;

The above is a clinical trial exclusion criterion. Annotated with entity spans:
[Qualifier: severe] [Condition: valvular] or [Condition: left ventricular outflow obstruction] disease needing [Procedure: intervention];